Hypersensibility to toxin or excipients

The above is a clinical trial exclusion criterion. Annotated with entity spans:
[Condition: Hypersensibility] to [Drug: toxin] or [Drug: excipients]